¿Cuál de las siguientes manifestaciones es una urgencia para la mujer gestante?:
1. Aparición de varices.
2. Leucorrea.
3. Polaquiuria.
4. Cefalea intensa.
5. Náuseas.

Respuesta correcta: 4. Cefalea intensa.